Clinical trial exclusion criterion:
Drug and / or alcohol abusers

Annotated entities:
- Condition: "alcohol abusers"
- Condition: "Drug abusers"